一位淋巴瘤病人接受化學治療CHOP（cyclophosphamide，adriamycin，vincristine及prednisolone）後出現指端麻木感，這個症狀最可能是那種藥的副作用？
A. cyclophosphamide
B. adriamycin
C. vincristine
D. prednisolone

正確答案：C. vincristine